history of bleeding peptic ulcer

The above is a clinical trial exclusion criterion. Annotated with entity spans:
history of [Condition: bleeding] [Condition: peptic ulcer]